Healthy male volunteers, 18 to 45 years of age, inclusive. Healthy status is defined by absence of evidence of any active or chronic disease following a detailed medical and surgical history, a complete physical examination including vital signs, 12-lead ECG, hematology, blood chemistry, serology and urinalysis

The above is a clinical trial inclusion criterion. Annotated with entity spans:
[Condition: Healthy] [Person: male] volunteers, [Value: 18 to 45 years] of [Person: age], inclusive. Healthy status is defined by [Negation: absence] of [Observation: evidence of any active or chronic disease] following a detailed [Temporal: medical] and [Temporal: surgical history], a complete [Procedure: physical examination] including [Procedure: vital signs], [Procedure: 12-lead ECG], [Procedure: hematology], [Procedure: blood chemistry], [Procedure: serology] and [Procedure: urinalysis]